下列何種神經傳導元素功能失調，一般被認為是阿茲海默症（Alzheimer's disease）之主要病因？
A. 多巴胺（dopamine）
B. 乙醯膽鹼（acetylcholine）
C. 血清素（serotonin）
D. 物質 P（substance P）

正確答案：B. 乙醯膽鹼（acetylcholine）